Subject has a known allergy to titanium, polyethylene or polyester materials.

The above is a clinical trial exclusion criterion. Annotated with entity spans:
Subject has a known [Condition: allergy] to [Drug: titanium], [Drug: polyethylene] or [Drug: polyester] materials.